經由病史詢問得知某女性患者曾懷孕過兩次，但這兩次懷孕都因為自然流產而終止妊娠。下列何者最適合用於描繪她的情況？
A. Multipara
B. Nulligravida
C. Nullipara
D. Primipara

正確答案：C. Nullipara